What is SAR425899?

SAR425899 ia a dual glucagon-like peptide-1 receptor/glucagon receptor agonist.